Clinical trial inclusion criterion:
indication of general anesthesia with tracheal intubation

Entity relations:
- AND("general anesthesia", "tracheal intubation")
- Has_mood("general anesthesia", "indication")